Subject has curettage for retained product after second trimester abortion

The above is a clinical trial inclusion criterion. Annotated with entity spans:
Subject has [Procedure: curettage] for [Condition: retained product] after [Qualifier: second trimester] [Procedure: abortion]